19. Subjects must not donate blood while on study and for at least 90 days following the last MEDI4736 treatment.

The above is a clinical trial exclusion criterion. Annotated with entity spans:
[Parsing_Error: 19.] Subjects must [Negation: not] [Procedure: donate blood] [Temporal: while on study] and [Temporal: for at least 90 days following the last MEDI4736 treatment].